下列何者最適合描述目前臺灣健康保險的體系特性？
A. 自願性參加且直接給付醫療服務的保險體系
B. 自願性參加且就醫時先付費再事後核退醫療費用的保險體系
C. 政府保險部門與醫療體系相互進行組織整合的公共整合體系
D. 政府保險部門與醫療體系訂定合約，但與人民之間沒有合約的公共單一契約體系

正確答案：D. 政府保險部門與醫療體系訂定合約，但與人民之間沒有合約的公共單一契約體系